Eastern Cooperative Oncology Group (ECOG) performance status =< 1

The above is a clinical trial inclusion criterion. Annotated with entity spans:
[Measurement: Eastern Cooperative Oncology Group] ([Measurement: ECOG]) performance status [Value: =< 1]